Clinical trial inclusion criterion:
Drug abuse

Annotated entities:
- Condition: "Drug abuse"